Clinical trial exclusion criterion:
Age = 17.

Annotated entities:
- Person: "Age"
- Value: "= 17"